5. > 18 years old

The above is a clinical trial inclusion criterion. Annotated with entity spans:
5. > [Value: 18 years] [Person: old]